Las muestras gratuitas de medicamentos de fabricación industrial tienen la consideración de publicidad excepcional; como tal, sólo se entregarán durante un tiempo máximo de:
1. Un año contado desde la fecha de autorización del medicamento.
2. Cinco años contados desde la fecha de autorización del medicamento.
3. Seis meses contados desde la fecha de autorización del medicamento.
4. Dos años contados desde la fecha de autorización del medicamento.
5. Un mes contado desde la fecha de autorización del medicamento.

Respuesta correcta: 4. Dos años contados desde la fecha de autorización del medicamento.